Clinical trial exclusion criteria:
adjuvant radiotherapy
evident intra-abdominal inflammation (diagnosed by imaging and/or laboratory results, including an abscess or cholecystitis)
chronic pancreatitis
pancreatic polypeptide producing endocrine tumor
American Society of Anesthesiologists physical-health status classification (ASA-PS)>3
Poorly regulated diabetes (>200 mg/dl (=11 mmol/l))

Annotated entities:
- Procedure: "adjuvant radiotherapy"
- Condition: "intra-abdominal inflammation"
- Procedure: "imaging"
- Procedure: "laboratory"
- Condition: "abscess"
- Condition: "cholecystitis"
- Condition: "chronic pancreatitis"
- Multiplier: "chronic"
- Condition: "pancreatitis"
- Condition: "pancreatic polypeptide producing endocrine tumor"
- Measurement: "American Society of Anesthesiologists physical-health status classification (ASA-PS)"
- Value: ">3"
- Qualifier: "Poorly regulated"
- Condition: "diabetes"
- Qualifier: ">200 mg/dl (=11 mmol/l)"